Meets IR criteria and M3 marrow on day 15 (not SR and M3 on day 15)

The above is a clinical trial inclusion criterion. Annotated with entity spans:
[Line: Meets IR criteria and M3 marrow on day 15 (not SR and M3 on day 15)]